Clinical trial exclusion criterion:
Implanted cardiac pacemaker of defibrillator

Annotated entities:
- Device: "cardiac pacemaker"
- Device: "defibrillator"